Clinical trial exclusion criterion:
Malignancy diagnosed or treated within 5 years (recent localized treatment of squamous or non-invasive basal cell skin cancers is permitted; cervical carcinoma in situ is allowed if appropriately treated prior to screening); subjects under evaluation for a malignancy are not eligible.

Annotated entities:
- Condition: "Malignancy"
- Temporal: "within 5 years"
- Procedure: "treatment"
- Qualifier: "localized"
- Temporal: "recent"
- Condition: "squamous cell skin cancer"
- Condition: "non-invasive basal cell skin cancer"
- Negation: "permitted"
- Condition: "cervical carcinoma in situ"
- Negation: "allowed"
- Procedure: "treated"
- Qualifier: "appropriately"
- Temporal: "prior to screening"
- Non-representable: "subjects under evaluation for a malignancy are not eligible."